Clinical trial inclusion criterion:
(1) cases of infertility, older than 20 years of age and not older than 40 years.

Entity relations:
- Has_value("age", "older than 20 years")
- Has_value("age", "not older than 40 years")